liver disease

The above is a clinical trial exclusion criterion. Annotated with entity spans:
[Condition: liver disease]